有關處方脊椎裝具（spinal orthotics）的常見適應症（indications），以下何者不適當？
A. 穩固因骨折或手術後的脊柱不穩定（stabilize the spine after fracture and postsurgical stabilization）
B. 限制脊椎的活動度來減緩疼痛（limit spinal motion in cases of pain or sprain）
C. 強化腹肌和背肌的核心肌肉力量（strengthen the core muscle）
D. 支撐患者的脊柱及避免脊椎變形（support posture and prevent deformity）

正確答案：C. 強化腹肌和背肌的核心肌肉力量（strengthen the core muscle）